age > 18 y.o.

The above is a clinical trial inclusion criterion. Annotated with entity spans:
[Person: age] [Value: > 18 y.o].